¿Cuál de las siguientes afirmaciones NO es correcta sobre la parálisis de Bell?:
1. Es un trastorno del octavo par craneal.
2. Su inicio es repentino, aunque suele precederle dolor detrás de la oreja o a lo largo de la mandíbula.
3. Sus manifestaciones son la parálisis de los músculos faciales de un lado de la cara, de la parte superior del parpado y aumento de lagrimación por el lado afectado.
4. Se desconoce la causa exacta aunque se ha establecido una relación con el virus del herpes simple.

Respuesta correcta: 1. Es un trastorno del octavo par craneal.